Clinical trial exclusion criterion:
History or known presence of infectious causes of myelopathy (e.g., syphilis, Lyme disease, human T-lymphotropic virus 1 (HTLV-1), herpes zoster myelopathy)

Annotated entities:
- Condition: "infectious causes"
- Condition: "myelopathy"
- Condition: "syphilis"
- Condition: "Lyme disease"
- Condition: "human T-lymphotropic virus 1 (HTLV-1)"
- Condition: "herpes zoster myelopathy"